Clinical trial exclusion criterion:
Any metabolic disease bone disease that has not been stabilized for at least three months (e.g., Paget's disease, osteomalacia, osteogenesis imperfecta, thyroid and/or parathyroid gland disorder, etc.).

Annotated entities:
- Condition: "metabolic disease"
- Observation: "been stabilized"
- Temporal: "for at least three months"
- Condition: "Paget's disease"
- Condition: "osteomalacia"
- Condition: "osteogenesis imperfecta"
- Condition: "thyroid"
- Condition: "parathyroid gland disorder"
- Negation: "not"
- Condition: "bone disease"